下列那一項不屬於溫室效應氣體（green house gases）？
A. N2O
B. CO2
C. CH4
D. NH3

正確答案：D. NH3